有關懷孕期間內科疾病的處理，下列敘述何者最為適當？
A. 子癲前症（preeclampsia）之特色是高血壓與蛋白尿，此類患者在懷孕過程中絕對禁用阿斯匹靈
B. 孕婦於懷孕中、後期出現高血壓，為了減少蛋白尿的發生，在腎功能與鉀離子都正常時，應以選擇性的血管張力素受體阻斷劑（angiotensin receptor blocker），作為第一線高血壓治療用藥
C. 瓣膜性心臟病患在懷孕過程中，心因性死亡的可能性以二尖瓣狹窄（mitral stenosis）患者為最高
D. 妊娠糖尿病發生時，為了減少妊娠併發症，應積極以藥物控制孕婦血糖，其中，以DPP-IV抑制劑

正確答案：C. 瓣膜性心臟病患在懷孕過程中，心因性死亡的可能性以二尖瓣狹窄（mitral stenosis）患者為最高